Clinical trial exclusion criterion:
Use of oral or intravaginal antibiotics within the past 2 weeks

Entity relations:
- Has_temporal("oral antibiotics", "within the past 2 weeks")
- OR("oral antibiotics", "intravaginal antibiotics")